下列關於透納氏症候群（Turner syndrome）的描述，何者不正確？
A. 最常見的染色體異常為 45,X
B. 身材矮小是常見的臨床表徵
C. 生長激素缺乏是其身材矮小的主要原因
D. 生長激素治療可改善其成人身高

正確答案：C. 生長激素缺乏是其身材矮小的主要原因